What is the effect of Satb1 knock-out in mice?

inhibited cell viability and migration